有關cerebral palsy之敘述，下列何者錯誤？
A. cerebral palsy的病人不一定會合併智能障礙
B. 最嚴重的型態是hemiplegia
C. 要診斷為cerebral palsy時須事先排除其他進行性腦病變的可能
D. cerebral palsy的治療需要復健師與心理師的幫忙

正確答案：B. 最嚴重的型態是hemiplegia